Clinical trial inclusion criterion:
OA cohort: Diagnosis of osteoarthritis made by physician.

Entity relations:
- Has_context("osteoarthritis", "made by physician")
- AND("OA", "osteoarthritis")